胚胎發育約第七天時，在內細胞團（inner cell mass）之下胚葉（hypoblast）會發育成下列何者？
A. 脊索（notochord）
B. 原始內胚層（primary endoderm）
C. 外胚層（ectoderm）
D. 中胚層（mesoderm）

正確答案：B. 原始內胚層（primary endoderm）